Clinical trial exclusion criterion:
Alcohol and other drug abuse cases based on 6 months before screening.

Entity relations:
- OR("Alcohol abuse", "drug abuse")